History of infection or intraarticular fracture of the affective hip

The above is a clinical trial exclusion criterion. Annotated with entity spans:
[Temporal: History] of [Condition: infection] or [Condition: intraarticular fracture] of the [Qualifier: affective hip]